Clinical trial exclusion criterion:
Prisoners (as defined by Office of Human Research Protection) at the time of enrollment ARE NOT ELIGIBLE for study entry. However, subjects who become prisoners after being enrolled will be included and not be withdrawn from the study. Patients on parole or probation are eligible for enrollment.

Annotated entities:
- Person: "Prisoners"
- Qualifier: "Office of Human Research Protection"
- Temporal: "at the time of enrollment"
- Reference_point: "the time of enrollment"
- Non-representable: "However, subjects who become prisoners after being enrolled will be included and not be withdrawn from the study. Patients on parole or probation are eligible for enrollment."